Clinical trial exclusion criteria:
History of a seizure disorder other than a single childhood febrile seizure.
History or presence of clinically important hepatic or renal disease or other medical disease.
Presence or recent history of major depressive disorder, bipolar disorder, psychotic disorder, or generalized anxiety disorder requiring therapy.

Annotated entities:
- Condition: "seizure disorder"
- Condition: "childhood febrile seizure"
- Multiplier: "single"
- Temporal: "History"
- Negation: "other than"
- Temporal: "History"
- Condition: "clinically important hepatic disease"
- Condition: "clinically important renal disease"
- Condition: "clinically important other medical disease"
- Temporal: "history"
- Condition: "major depressive disorder"
- Condition: "bipolar disorder"
- Condition: "psychotic disorder"
- Condition: "generalized anxiety disorder"
- Qualifier: "requiring therapy"